一位 60 歲男性病患於一週前因退化性關節炎接受左髖部人工髖關節全置換手術治療（Total Hip Replacement），術後連續五天注射止痛劑和 Cephalosporin 治療，病人於術後第 7 天開始發生持續性腹瀉、腹痛、且帶有少許血便，發燒及白血球增多，但並無腹膜炎現象，此時除了 stool culture 之外，該先如何處理？
A. 給予 Buscopan，並重新使用 Cephalosporin 治療
B. 作 stool cytotoxin assay，保守性治療，並安排大腸鏡檢查
C. 安排 Barium enema 檢查
D. 安排緊急全大腸切除術治療

正確答案：B. 作 stool cytotoxin assay，保守性治療，並安排大腸鏡檢查